Clinical trial exclusion criterion:
Presence of organic pathology identified by upper endoscopy or other investigations

Annotated entities:
- Procedure: "upper endoscopy"
- Condition: "organic pathology"
- Procedure: "investigations"